Clinical trial exclusion criterion:
No secure diagnosis of epilepsy

Entity relations:
- Has_negation("epilepsy", "No")